Clinical trial exclusion criterion:
Unwillingness or inability to cooperate, or for the parents or guardians to give consent, or for the child to give assent, or any condition of sufficient severity to impair cooperation in the study

Entity relations:
- OR("Unwillingness to cooperate", "Unwillingness for the parents to give consent", "Unwillingness for the guardians to give consent", "inability for the guardians to give consent", "inability for the parents to give consent", "inability to cooperate")